El epitelio de la epidermis es:
1. Plano estratificado queratinizado.
2. Plano estratificado no queratinizado.
3. Cilíndrico simple queratinizado.
4. Cilíndrico estratificado queratinizado.
5. Cúbico estratificado.

Respuesta correcta: 1. Plano estratificado queratinizado.